Age 1 day to less than 18 years

The above is a clinical trial inclusion criterion. Annotated with entity spans:
[Person: Age] [Value: 1 day to less than 18 years]